有關剖腹產孕婦之預防性抗生素之給予，若孕婦對penicillin或cephalosporin嚴重過敏，下列何者為最適合之預防性抗生素？
A. clindamycin
B. levofloxacin
C. clindamycin加上gentamicin
D. clindamycin加上metronidazole

正確答案：C. clindamycin加上gentamicin